A positive reaction for HIV infection, viral hepatitis B and hepatitis C;

The above is a clinical trial exclusion criterion. Annotated with entity spans:
A [Value: positive] [Measurement: reaction for HIV infection], viral hepatitis B and hepatitis C;